Clinical trial exclusion criterion:
Liver disease or elevated liver enzymes

Entity relations:
- Has_value("liver enzymes", "elevated")